Signs of life-threatening cerebral edema or multi-organ failure upon presentation to the emergency room or pediatric intensive care unit

The above is a clinical trial exclusion criterion. Annotated with entity spans:
[Mood: Signs of] [Qualifier: life-threatening] [Condition: cerebral edema] or [Condition: multi-organ failure] [Temporal: upon presentation to the emergency room or pediatric intensive care unit]